一位 75 歲女性病患，不慎跌倒，發生背部劇痛，經照 X 光檢查發現第一腰椎和第三腰椎出現壓迫性骨折，血液生化檢查和血球計數檢查正常，下列何項敘述正確？
A. 檢查骨密度的最合適部位為腰椎
B. 目前最好的骨密度檢查為超音波骨密度檢查
C. 通常不須施行減壓手術治療
D. 使用雙磷酸鹽治療即可促進造骨細胞合成骨骼，不須補充鈣

正確答案：C. 通常不須施行減壓手術治療